Clinical trial inclusion criterion:
Patients may have received chemotherapy for hormone-sensitive metastatic prostate cancer only, but it must not have lasted for more than 6 months. At least 12 months must have elapsed since completion of chemotherapy.

Entity relations:
- Has_qualifier("prostate cancer", "metastatic")
- Has_qualifier("prostate cancer", "hormone-sensitive")
- AND("chemotherapy", "prostate cancer")
- Has_negation("lasted for more than 6 months", "not")
- Has_multiplier("chemotherapy", "lasted for more than 6 months")
- multi("completion of chemotherapy", "chemotherapy")
- Has_index("At least 12 months must have elapsed since completion of chemotherapy", "completion of chemotherapy")
- Has_temporal("chemotherapy", "At least 12 months must have elapsed since completion of chemotherapy")